Insulin dependent Diabetes Mellitus

The above is a clinical trial exclusion criterion. Annotated with entity spans:
[Qualifier: Insulin dependent] [Condition: Diabetes Mellitus]